Clinical trial exclusion criterion:
Infectious pathologies evoluting and requiring antibiotherapy.

Annotated entities:
- Condition: "Infectious pathologies"
- Qualifier: "evoluting"
- Qualifier: "requiring antibiotherapy"
- Drug: "antibiotherapy"